What are the advantages of liquid biopsy in NSCLC?

Liquid biopsy reflected spatial and temporal heterogeneity of the tumor under treatment pressure.